Clinical trial exclusion criterion:
Previous prescription of mineralocorticoid receptor antagonists, for cCSC or for other diseases;

Entity relations:
- AND("mineralocorticoid receptor antagonists", "cCSC")
- Has_temporal("mineralocorticoid receptor antagonists", "Previous")
- OR("cCSC", "other diseases")